Clinical trial exclusion criteria:
Contraindication to Clopidogrel
Smoking (current smokers and patients who quit smoking less than six months)
Malignancy(diagnosed or under investigation)
Haematological disorders (Anaemia, malignancy, bleeding disorders)
Women of child-bearing potential
Use of corticosteroids/other antithrombotic agents(warfarin)
Chronic liver disease (Cirrhosis, malignancy and patients with more than twice the upper limit of liver function tests)
Unable to consent.
Use of other investigational study drugs within 1 year prior to study entry
Previous participation in this study

Annotated entities:
- Drug: "Clopidogrel"
- Condition: "Contraindication"
- Condition: "Smoking"
- Condition: "smokers"
- Temporal: "current"
- Condition: "quit smoking"
- Temporal: "less than six months"
- Condition: "Malignancy"
- Mood: "diagnosed"
- Mood: "under investigation"
- Condition: "Haematological disorders"
- Condition: "Anaemia"
- Condition: "malignancy"
- Condition: "bleeding disorders"
- Person: "Women"
- Condition: "child-bearing potential"
- Drug: "corticosteroids"
- Drug: "antithrombotic agents"
- Drug: "warfarin"
- Condition: "Chronic liver disease"
- Condition: "Cirrhosis"
- Condition: "malignancy"
- Value: "more than twice the upper limit"
- Measurement: "liver function tests"
- Observation: "Unable to consent."
- Drug: "investigational study drugs"
- Temporal: "within 1 year prior to study entry"
- Temporal: "Previous"
- Observation: "participation in this study"